依據個人偵測分析數據，下列何種行為之暴露，會占苯暴露的最大比例來源？
A. 抽菸
B. 旅行中來自汽機車排放之暴露
C. 大氣中來自汽機車排放之暴露
D. 大氣中來自工業之暴露

正確答案：A. 抽菸